parental refusal

The above is a clinical trial exclusion criterion. Annotated with entity spans:
[Informed_consent: parental refusal]